What receptor is associated with the protein encoded by the Spätzle gene?

The  Drosophila  Toll-1 receptor is involved in embryonic development, innate immunity, and tissue homeostasis. Currently, as a ligand for the  Toll-1 receptor, only  Spatzle ( Spz) has been identified and characterized.